Clinical trial exclusion criterion:
Any suspicion or history of alcohol abuse and/or consumption of other drugs of abuse

Entity relations:
- Has_context("alcohol abuse", "suspicion")
- OR("suspicion", "history")
- OR("alcohol abuse", "consumption of other drugs of abuse")